Clinical trial exclusion criterion:
Current systemic steroid use

Annotated entities:
- Temporal: "Current"
- Procedure: "systemic steroid use"
- Qualifier: "systemic"
- Drug: "steroid"